Clinical trial exclusion criterion:
Tubal disease.

Annotated entities:
- Condition: "Tubal disease"